下列對於胰臟癌之敘述，何者並不適合？
A. 胰臟癌好發於胰臟體部，其次為頭和迴溝處（uncinate process）或胰尾；預後與診斷時的腫瘤分期最有關聯
B. 多層次細切片的電腦斷層為最符合效益的診斷工具，可以幫忙診斷是否有轉移及能否手術
C. 和其他壺腹周遭惡性腫瘤相比，胰臟癌的預後普遍較同期別的惡性腫瘤為差
D. 診斷性腹腔鏡可以協助確定是否有腹膜轉移或惡性腹水，對於不確定是否可以切除的病患，建議進行

正確答案：A. 胰臟癌好發於胰臟體部，其次為頭和迴溝處（uncinate process）或胰尾；預後與診斷時的腫瘤分期最有關聯